Ongoing need for psychoactive medication other than study medication [excepting stable doses (greater than three months duration) of anticonvulsant medication for seizure disorder, or diphenhydramine (Benadryl®)for sleep]

The above is a clinical trial exclusion criterion. Annotated with entity spans:
Ongoing need for [Drug: psychoactive medication] [Negation: other than] [Drug: study medication] [[Negation: excepting] [Subjective_judgement: stable doses] ([Temporal: greater than three months] duration) of [Drug: anticonvulsant medication] for [Condition: seizure disorder], or [Drug: diphenhydramine] (Benadryl®)for sleep]